有一男性病人，長年工作是花崗岩挖工，主訴乾咳及呼吸困難。胸部 X 光顯示，分散性結節且有周邊鈣化現象，其診斷最可能是：
A. 碳沈積症
B. 鈹沈積症
C. 矽沈積症
D. 石綿沈積症

正確答案：C. 矽沈積症